Clinical trial exclusion criterion:
Special needs participants who are unable to comprehend study-related instructions (eg, mild to profound mental retardation [intelligence quotient <70], moderate to severe cognitive developmental delay, pervasive development disorders, autism)

Entity relations:
- Has_qualifier("unable to comprehend instructions", "study-related")
- Has_qualifier("mental retardation", "mild to profound")
- Has_value("intelligence quotient", "<70")
- Has_qualifier("cognitive developmental delay", "moderate to severe")
- Subsumes("mental retardation", "intelligence quotient")
- Subsumes("unable to comprehend instructions", "mental retardation")
- OR("mental retardation", "cognitive developmental delay", "pervasive development disorders", "autism")